Clinical trial exclusion criterion:
Major medical disorders (e.g., HIV, cancer)

Entity relations:
- Has_qualifier("medical disorders", "Major")
- Subsumes("medical disorders", "HIV")
- OR("HIV", "cancer")